Clinical trial exclusion criterion:
Patients ASA III y IV

Annotated entities:
- Measurement: "ASA"
- Value: "III y IV"